下列何者不是右心衰竭的主要症狀？
A. 頸靜脈擴張
B. 肝腫大
C. 下肢水腫
D. 肺鬱血

正確答案：D. 肺鬱血